Clinical trial exclusion criterion:
No lesion should be included when more than 50% of the lesion is further down than 4 cm beneath the skin level.

Entity relations:
- Has_value("beneath the skin level", "further down than 4 cm")
- Has_multiplier("lesion", "more than 50% of the lesion")
- AND("lesion", "beneath the skin level")